Patients may also be excluded at the discretion of the investigator

The above is a clinical trial exclusion criterion. Annotated with entity spans:
[Non-query-able: Patients may also be excluded at the discretion of the investigator]